Clinical trial exclusion criterion:
Subject has a known allergy to titanium, polyethylene or polyester materials.

Entity relations:
- AND("allergy", "titanium")
- OR("titanium", "polyester", "polyethylene")